Clinical trial exclusion criterion:
Current treatment with corticosteroids (topical or systemic), corticosteroid use within 3 months before possible start of trial treatment, or anticipated start of corticosteroid treatment within the first 2 years from the start of the trial period;

Entity relations:
- Has_temporal("corticosteroids", "Current")
- Has_qualifier("corticosteroids", "topical")
- Has_index("within 3 months before possible start of trial treatment", "possible start of trial treatment")
- Has_index("within the first 2 years from the start of the trial period", "the first 2 years from the start of the trial period")
- Has_mood("corticosteroid treatment", "anticipated")
- Has_temporal("corticosteroid treatment", "within the first 2 years from the start of the trial period")
- Has_temporal("corticosteroid use", "within 3 months before possible start of trial treatment")
- Has_qualifier("corticosteroids", "systemic")
- OR("corticosteroids", "corticosteroid use", "corticosteroid treatment")